Patient has demonstrated compliance, as assessed by the investigator, with the parent study protocol requirements

The above is a clinical trial inclusion criterion. Annotated with entity spans:
Patient has demonstrated [Observation: compliance], [Non-representable: as assessed by the investigator], with the parent study protocol requirements